Those that meet the ACR 1990 and 2010 criteria for Fibromyalgia.

The above is a clinical trial inclusion criterion. Annotated with entity spans:
Those that meet the [Qualifier: ACR 1990] and 2010 criteria for [Condition: Fibromyalgia].